下列 B 型肝炎病毒母兒感染之相關敘述，何者正確？
A. 多數被感染嬰兒在新生兒期即呈血清 HBsAg 陽性
B. 不會有子宮內感染發生
C. 帶原母親餵食母奶不會增加嬰兒之感染率
D. 只有少數是在周產期發生感染

正確答案：C. 帶原母親餵食母奶不會增加嬰兒之感染率